inability to communicate pain scores or need for analgesia

The above is a clinical trial exclusion criterion. Annotated with entity spans:
[Post-eligibility: inability to communicate pain scores or need for analgesia]